Clinical trial exclusion criterion:
Severe supine hypertension (Systolic Blood Pressure >180 or Diastolic Blood Pressure>110mmHg)

Entity relations:
- Has_qualifier("supine hypertension", "Severe")
- Has_value("Diastolic Blood Pressure", ">110mmHg")
- Has_value("Systolic Blood Pressure", ">180")
- Subsumes("supine hypertension", "Systolic Blood Pressure")
- OR("Systolic Blood Pressure", "Diastolic Blood Pressure")